Clinical trial exclusion criterion:
requirement for oxygen therapy at low altitude residence

Annotated entities:
- Procedure: "oxygen therapy"